Clinical trial exclusion criterion:
6. Newly diagnosed with PAH and not on PAH-specific therapy.

Annotated entities:
- Parsing_Error: "6."
- Condition: "PAH"
- Procedure: "PAH-specific therapy"
- Negation: "not"
- Temporal: "Newly diagnosed"